Clinical trial inclusion criterion:
Age 18 years or older

Entity relations:
- Has_value("Age", "18 years or older")